Clinical trial exclusion criterion:
Cervical cytology other than PAP I or PAP II (Papanicolaou) or cervical high risk human papillomavirus (HPV) positivity

Annotated entities:
- Measurement: "Cervical cytology"
- Negation: "other"
- Qualifier: "PAP I"
- Qualifier: "PAP II"
- Qualifier: "Papanicolaou"
- Qualifier: "human papillomavirus"
- Qualifier: "cervical high risk"
- Qualifier: "HPV"
- Value: "positivity"